有關 Benzodiazepines 類鎮靜-催眠（Sedative-hypnotic）藥物，對於正常睡眠週期的影響，下列何者錯誤？
A. 縮短眼球快動型睡眠（Rapid eye movement）的期間
B. 縮短第二期非眼球快動型睡眠（Non-rapid eye movement）的期間
C. 縮短進入睡眠所需要的時間
D. 縮短第四期非眼球快動型睡眠（Non-rapid eye movement）的期間

正確答案：B. 縮短第二期非眼球快動型睡眠（Non-rapid eye movement）的期間